Clinical trial inclusion criterion:
The patient was on nonsteroid anti-inflammatory drug (NSAID) treatment on the day when consent was obtained, and requires the long-term continuous treatment even after treatment with the investigational drug is started.

Entity relations:
- Has_index("on the day when consent was obtained", "the day when consent was obtained")
- Has_temporal("nonsteroid anti-inflammatory drug (NSAID)", "on the day when consent was obtained")
- multi("the day when consent was obtained", "consent")